La urea:
1. Se transporta al hígado para su eliminación.
2. Se degrada a amonio en el ciclo de la urea.
3. Es apolar y forma fácilmente cristales.
4. Se obtiene a partir de la arginina.
5. Presenta dos grupos cetona y un grupo amino.

Respuesta correcta: 4. Se obtiene a partir de la arginina.